When is 16S rRNA Gene Sequencing used?

Taxonomic characterization is performed by genotypic approaches such as 16S rRNA gene sequencing.